Clinical trial exclusion criterion:
Mental , physical incapacity to fill in the questionnaires

Annotated entities:
- Condition: "physical incapacity"
- Condition: "Mental incapacity"
- Procedure: "fill in the questionnaires"